Any tobacco or nicotine product use in the past year

The above is a clinical trial exclusion criterion. Annotated with entity spans:
Any [Observation: tobacco] or [Observation: nicotine product use] in the [Temporal: past year]